Systolic pulmonary artery pressure (SPAP) >40 mmHg (and/or tricuspid regurgitation [TR] jet velocity >2.9 m/s) In cases where an actual SPAP value is not measurable due to lack of adequate TR jet, the pulmonary flow acceleration time measured at the right ventricular outflow tract (RVOTAT) will be used to assess eligibility. Participants with a RVOTAT =100 milliseconds (msec) will be excluded, suggesting an elevated mean SPAP; eligibility for the those participants with RVOTAT between 100 and 120 msec will be determined based on combined assessment of the TR jet, septal motion, and right ventricular size.

The above is a clinical trial exclusion criterion. Annotated with entity spans:
[Measurement: Systolic pulmonary artery pressure (SPAP)] [Value: >40 mmHg] (and/or [Measurement: tricuspid regurgitation [TR] jet velocity] [Value: >2.9 m/s]) [Non-representable: In cases where an actual SPAP value is not measurable due to lack of adequate TR jet, the pulmonary flow acceleration time measured at the right ventricular outflow tract (RVOTAT) will be used to assess eligibility.] Participants with a [Measurement: RVOTAT] [Value: =100 milliseconds (msec)] will be excluded, [Non-representable: suggesting an elevated mean SPAP; eligibility for the those participants with RVOTAT between 100 and 120 msec will be determined based on combined assessment of the TR jet, septal motion, and right ventricular size.]